¿Cuál de estas igualdades es INCORRECTA?
1. Decil 1=Centil 10.
2. Cuartil 1=Percentil 25.
3. Quartil 2=Centil 20.
4. Decil 5=Mediana.
5. Cuartil 3=Centil 75.

Respuesta correcta: 3. Quartil 2=Centil 20.